Clinical trial inclusion criteria:
Clinical diagnosis of allergic rhinitis based on sneeze attacks, runny/blocked/itchy nose in the absence of a common cold during the previous 12 months.
History of positive skin prick test or blood radio-allergosorbent test (RAST) to grass and/or ragweed pollen

Annotated entities:
- Condition: "allergic rhinitis"
- Condition: "sneeze attacks"
- Condition: "runny nose"
- Condition: "blocked nose"
- Condition: "itchy nose"
- Condition: "common cold"
- Negation: "absence"
- Temporal: "during the previous 12 months"
- Measurement: "skin prick test"
- Value: "positive"
- Measurement: "blood radio-allergosorbent test (RAST)"
- Qualifier: "grass"
- Qualifier: "ragweed pollen"